Clinical trial exclusion criterion:
Prior endobronchial treatment for emphysema

Annotated entities:
- Procedure: "endobronchial treatment"
- Condition: "emphysema"
- Temporal: "Prior"